Clinical trial inclusion criterion:
At least one void.

Annotated entities:
- Multiplier: "At least one"
- Observation: "void"